Not intending or wishing to become pregnant over the course of the study

The above is a clinical trial inclusion criterion. Annotated with entity spans:
[Pregnancy_considerations: Not intending or wishing to become pregnant over the course of the study]